Clinical trial exclusion criterion:
Stroke or Transient Ischemic Attack (TIA) within the past 6 months or any permanent residual neurological defect

Annotated entities:
- Condition: "Transient Ischemic Attack (TIA)"
- Condition: "Stroke"
- Temporal: "within the past 6 months"
- Condition: "residual neurological defect"